Clinical trial exclusion criterion:
Allergy to acetazolamide and other sulfonamides.

Entity relations:
- Has_qualifier("sulfonamides", "other")
- AND("Allergy", "acetazolamide")
- OR("acetazolamide", "sulfonamides")